關於男孩性早熟（precocious puberty），下列那一項的致病機轉與其他三者不同？
A. 水腦（hydrocephalus）
B. 下視丘錯構瘤（hypothalamic hamartoma）
C. 分泌人絨毛膜性腺促素（HCG-secreting）的視丘腫瘤
D. 長期未治療之原發性甲狀腺低能症（primary hypothyroidism）

正確答案：C. 分泌人絨毛膜性腺促素（HCG-secreting）的視丘腫瘤